Clinical trial inclusion criterion:
At least six (6) weeks of failed, conservative treatment prior to surgery, or requires immediate surgery to prevent permanent disability.

Entity relations:
- Has_temporal("treatment", "prior to surgery")
- Has_multiplier("treatment", "At least six (6) weeks")
- Has_qualifier("treatment", "conservative")
- Has_qualifier("treatment", "failed")
- Has_mood("permanent disability", "prevent")
- AND("surgery", "permanent disability")
- Has_qualifier("surgery", "immediate")
- OR("treatment", "surgery")